Clinical trial exclusion criterion:
Subject has thrombocytosis (platelet count > 600,000 / µl) or thrombocytopenia (platelet count <100,000 / µl).

Entity relations:
- Has_value("platelet count", "> 600,000 / µl")
- AND("thrombocytosis", "platelet count")
- AND("thrombocytopenia", "platelet count")
- Has_value("platelet count", "<100,000 / µl")
- OR("thrombocytosis", "thrombocytopenia")